下列有關原發性隅角開放型青光眼的敘述，何者較正確？
A. 看電影後，眼壓會有增高的現象
B. 常會有不明原因的頭痛
C. 病人經常在傍晚時分感覺視力模糊
D. 大多數病例無明顯症狀

正確答案：D. 大多數病例無明顯症狀